Clinical trial inclusion criterion:
Patients with diagnosis of multiple myeloma according to criteria of the International Myeloma Working Group

Annotated entities:
- Condition: "multiple myeloma"
- Measurement: "criteria of the International Myeloma Working Group"